Affiliate or receiving a social security system.

The above is a clinical trial inclusion criterion. Annotated with entity spans:
[Non-query-able: Affiliate or receiving a social security system].